胸腺（thymus）主要位於：
A. 上縱隔（superior mediastinum）
B. 下前縱隔（anterior inferior mediastinum）
C. 下中縱隔（middle inferior mediastinum）
D. 下後縱隔（posterior inferior mediastinum）

正確答案：A. 上縱隔（superior mediastinum）